45 歲女性，最近數月來發現右側甲狀腺位置有一約 2 公分左右無痛腫塊，而至門診求診，病患過去偶有高血壓的情況，且因腎結石做過幾次體外震波碎石術，其母親也因甲狀腺癌過世。則臨床上鑑別診斷，下列何者較無診斷價值？
A. 血中 calcitonin 濃度
B. 血中副甲狀腺素（iPTH）濃度
C. 尿液 catecholamines 濃度
D. 血中 thyroglobulin 濃度

正確答案：D. 血中 thyroglobulin 濃度